Clinical trial inclusion criterion:
Abdominal obesity (>88cm women, >102cm men) AND hyperlipidemia (treated or fasting total cholesterol >240 English literacy Willing to provide informed consent

Annotated entities:
- Condition: "Abdominal obesity"
- Value: ">88cm"
- Value: ">102cm"
- Person: "women"
- Person: "men"
- Condition: "hyperlipidemia"
- Procedure: "treated"
- Measurement: "fasting total cholesterol"
- Value: ">240"
- Observation: "English literacy"
- Observation: "provide informed consent"
- Mood: "Willing to"